Clinical trial exclusion criterion:
Has bilateral sacroiliitis Grade 2 or unilateral sacroiliitis Grade 3 or Grade 4

Entity relations:
- Has_qualifier("sacroiliitis", "Grade 3")
- Has_qualifier("sacroiliitis", "unilateral")
- Has_qualifier("sacroiliitis", "Grade 2")
- Has_qualifier("sacroiliitis", "bilateral")
- OR("Grade 3", "Grade 4")
- OR("sacroiliitis", "sacroiliitis")